Clinical trial exclusion criterion:
pregnancy or lactating women

Annotated entities:
- Condition: "pregnancy"
- Condition: "lactating"
- Person: "women"